Clinical trial exclusion criterion:
No other major disease that prohibits study treatment (e.g., severe congenital heart disease)

Annotated entities:
- Negation: "No"
- Condition: "major disease"
- Qualifier: "other"
- Condition: "congenital heart disease"
- Qualifier: "severe"
- Non-query-able: "that prohibits study treatment"